Clinical trial inclusion criteria:
Willing and able to provide written informed consent and accept study procedures and time schedule.
Age = 18 years.
Patients suffering from chronic heart failure (the heart failure diagnosis must have been made or confirmed by a cardiologist and/or hospital physician at any time in the patient's medical history).
Patients with reduced ejection fraction (= 40%) as confirmed at any time point in the patient's medical history.

Annotated entities:
- Informed_consent: "Willing and able to provide written informed consent and accept study procedures and time schedule."
- Person: "Age"
- Value: "= 18 years"
- Condition: "chronic heart failure"
- Measurement: "ejection fraction"
- Value: "= 40%"